下列何者拒絕急救之要求，倫理上應不予接受？
A. 癌症末期病人因車禍內出血需手術治療者，家人要求不施行手術治療
B. 對已簽署 DNR 意願書的末期病人不施予 CPR
C. 對拒絕輸血的耶和華見證人會信徒，不予輸血
D. 癌症末期病人在其要求下，拔除其賴以灌食之鼻胃管

正確答案：A. 癌症末期病人因車禍內出血需手術治療者，家人要求不施行手術治療